Clinical trial exclusion criterion:
Previous malignancies within 2 yrs. unless relapse risk is small (< 5%).

Annotated entities:
- Condition: "malignancies"
- Temporal: "within 2 yrs."
- Non-query-able: "unless relapse risk is small (< 5%)"
- Subjective_judgement: "unless relapse risk is small (< 5%)"
- Undefined_semantics: "unless relapse risk is small (< 5%)"